History of myelodysplasia

The above is a clinical trial exclusion criterion. Annotated with entity spans:
History of [Condition: myelodysplasia]